Clinical trial exclusion criteria:
Contraindication for propofol administration
Contraindication for IAP measurement in supine position with head-of-bed at 0°
Other intervention for reduction of IAP planned
Previous propofol infusion rate >4 mg/kg/h

Annotated entities:
- Condition: "Contraindication"
- Drug: "propofol"
- Condition: "Contraindication"
- Procedure: "IAP measurement"
- Qualifier: "supine position"
- Qualifier: "head-of-bed at 0°"
- Qualifier: "Other"
- Procedure: "intervention for reduction of IAP"
- Mood: "planned"
- Temporal: "Previous"
- Measurement: "propofol infusion rate"
- Value: ">4 mg/kg/h"